Clinical trial exclusion criteria:
BMI > 30 kg.m-2,
ASA physical state >II
Allergy to the used local anesthetics
Infection at the injection site
age <18y

Annotated entities:
- Measurement: "BMI"
- Value: "> 30 kg.m-2"
- Measurement: "ASA physical state"
- Value: ">II"
- Condition: "Allergy"
- Drug: "local anesthetics"
- Condition: "Infection"
- Qualifier: "injection site"
- Person: "age"
- Value: "<18y"